Clinical trial exclusion criterion:
History or renal transplantation

Entity relations:
- Has_temporal("renal transplantation", "History")